下列那一種藥物對戒菸缺乏療效？
A. nicotine gum
B. benzodiazepines
C. clonidine
D. bupropion

正確答案：B. benzodiazepines